下列何種特徵會出現在 hemolytic anemia 的病人身上？
A. 正常紅血球的壽命增長
B. 血中 haptoglobin 增加
C. 骨髓造血功能降低
D. hemosiderinuria

正確答案：D. hemosiderinuria